Poseen ribosomas propios:
1. Lisosomas.
2. Peroxisomas.
3. Endosomas.
4. Gránulos de secreción.
5. Mitocondrias.

Respuesta correcta: 5. Mitocondrias.